Clinical trial exclusion criterion:
Donation or loss of greater than one pint of blood within 60 days of entry to the study

Annotated entities:
- Non-query-able: "Donation or loss of greater than one pint of blood within 60 days of entry to the study"